Clinical trial exclusion criterion:
other disorders that may affect balance or locomotion;

Annotated entities:
- Condition: "disorders that may affect balance or locomotion"
- Undefined_semantics: "disorders that may affect balance or locomotion"